Clinical trial exclusion criterion:
presence of subacute or chronic DVT more than 21 days in duration, inability to lie in the prone position required for intervention, terminal systemic disease requiring palliative treatment, active bleeding (from a gastric/duodenal ulcer or the cerebrovascular system), a haemorrhagic stroke within the previous year, an impaired bleeding-clotting profile, and any haemophilic disorder, or pregnancy.

Annotated entities:
- Qualifier: "subacute"
- Qualifier: "chronic"
- Condition: "DVT"
- Multiplier: "more than 21 days in duration"
- Condition: "inability to lie in the prone position"
- Non-representable: "required for intervention"
- Condition: "terminal systemic disease"
- Procedure: "palliative treatment"
- Mood: "requiring"
- Qualifier: "active"
- Condition: "bleeding"
- Condition: "duodenal ulcer"
- Condition: "gastric ulcer"
- Qualifier: "cerebrovascular system"
- Condition: "haemorrhagic stroke"
- Temporal: "within the previous year"
- Condition: "impaired bleeding-clotting profile"
- Condition: "haemophilic disorder"
- Condition: "pregnancy"